敗血症（sepsis）發生時，下列那一種細胞激素（cytokine）是造成敗血性休克（septic shock）之主要原因？
A. interferon-α
B. G-CSF
C. IL-2
D. TNF-α

正確答案：D. TNF-α